Clinical trial exclusion criterion:
Involved in another interventional study

Annotated entities:
- Competing_trial: "Involved in another interventional study"